En la síntesis de proteínas, los enlaces pépticos se forman en la fase de:
1. Terminación.
2. Elongación.
3. Translocación.
4. Iniciación.

Respuesta correcta: 2. Elongación.